40 歲陳姓工程師，主訴將受聘到大陸廣州擔任工廠幹部，且至少會在當地工作 3 年，當地有 A 型肝炎疫情。因預計 6 個月後將攜帶懷孕的妻子及一位 11 個月大的男孩一起前去任職，下列有關 A 型肝炎疫苗注射的敘述，何者最為正確?
A. 建議陳姓夫妻本日皆接受抽血檢測，看是否具有 A 型肝炎抗體的保護力
B. 建議兩夫妻本日先接受 A 型肝炎疫苗接種，6 個月將出發前再接種第二劑
C. 建議小於 1 歲不適合打 A 型肝炎預防針的陳小弟，本日注射一劑 A 型肝炎免疫球蛋白，且劑量為
D. 就請陳姓工程師特別注意食物與飲水的衛生，不要喝未煮沸的水及食用沒有充分煮熟的食物

正確答案：A. 建議陳姓夫妻本日皆接受抽血檢測，看是否具有 A 型肝炎抗體的保護力